關於威爾森氏疾病（Wilson disease），下列敘述何者錯誤？
A. 屬於體染色體隱性（Autosomal recessive）遺傳疾病
B. 找不到病因的肝炎應把威爾森氏疾病列為鑑別診斷
C. 眼睛視網膜（Retina）會出現Kayser-Fleischer ring
D. 大部份病患血清中的Ceruloplasmin濃度會降低

正確答案：C. 眼睛視網膜（Retina）會出現Kayser-Fleischer ring